下列何者是術前診斷甲狀腺瘤良惡性最準確的方式？
A. 甲狀腺細針穿刺細胞學檢查
B. 甲狀腺超音波
C. 頸部電腦斷層
D. 頸部核磁共振

正確答案：A. 甲狀腺細針穿刺細胞學檢查